有關眼翼狀贅肉（pterygium），下列敘述何者正確？
A. 具傳染性
B. 有高度轉變為惡性腫瘤的可能
C. 手術切除後不易復發
D. 致病機轉與長期暴露於紫外線環境有關

正確答案：D. 致病機轉與長期暴露於紫外線環境有關